Clinical trial exclusion criterion:
Contraindication to sitagliptin or metformin or thiazolidinedione

Annotated entities:
- Drug: "sitagliptin"
- Drug: "metformin"
- Drug: "thiazolidinedione"
- Condition: "Contraindication"